A SLEDAI score is associated with Systemic Lupus Erythematosus. What is a SLEDAI score?

Disease activity of Systemic Lupus Erythematosis was evaluated according to the SLE Disease Activity Index (SLEDAI) score which score disease activity based on a number of parameters.